某位 34 歲的男士，車禍後感到頸部很痛，右腳無力。檢查時發現右腳振動感減低，左腳沒有痛覺。 最恰當的診斷應是：
A. Central cord syndrome
B. Anterior spinal cord syndrome
C. Brainstem injury
D. Brown-Séquard syndrome

正確答案：D. Brown-Séquard syndrome